Clinical trial inclusion criterion:
Patients who have given written informed consent

Annotated entities:
- Informed_consent: "Patients who have given written informed consent"